Clinical trial inclusion criterion:
Women with expected difficult IUD insertion like nulliparous women and women with previous cesarean section.

Annotated entities:
- Person: "Women"
- Mood: "expected"
- Qualifier: "difficult"
- Procedure: "IUD insertion"
- Observation: "nulliparous"
- Person: "women"
- Person: "women"
- Temporal: "previous"
- Procedure: "cesarean section"